3. Use of hormonal contraceptives and hormonal replacement therapy within three months prior to the initial dose of study medication.

The above is a clinical trial exclusion criterion. Annotated with entity spans:
[Parsing_Error: 3.] Use of [Drug: hormonal contraceptives] and [Drug: hormonal replacement therapy] [Temporal: within three months prior] to [Reference_point: the initial dose of study medication].